24. Hepatic dysfunction as defined by Child-Pugh Class B or C

The above is a clinical trial exclusion criterion. Annotated with entity spans:
[Parsing_Error: 24.] [Condition: Hepatic dysfunction] as defined by [Measurement: Child-Pugh] [Value: Class B or C]